List the components of the COMPASS complex

MLL4
MLL3
WDR5
RBBP5
ASH2
SET1